What disease is associated with mutations in the MECP2 transcription factor?

mutations in the methyl-cpg-binding protein-2 gene (mecp2) are commonly associated with rett syndrome